Clinical trial inclusion criterion:
Patients with allergic contact dermatitis to para-phenylenediamine (PPD) based on a history of PPD contact dermatitis and positive PPD patch tests.

Entity relations:
- AND("allergic contact dermatitis", "para-phenylenediamine (PPD)")
- AND("contact dermatitis", "PPD")
- Has_value("PPD patch tests", "positive")
- Subsumes("allergic contact dermatitis", "contact dermatitis")
- Subsumes("allergic contact dermatitis", "PPD patch tests")